Capable of giving signed informed consent which includes compliance with the requirements and restrictions listed in the consent form and protocol.

The above is a clinical trial inclusion criterion. Annotated with entity spans:
[Informed_consent: Capable of giving signed informed consent which includes compliance with the requirements and restrictions listed in the consent form and protocol.]